Diagnosed or suspected local gynecologic lesion (polyp, adenomyosis, myoma, malignancy or cervical pathology).

The above is a clinical trial exclusion criterion. Annotated with entity spans:
[Mood: Diagnosed] or [Mood: suspected] [Condition: local gynecologic lesion] ([Condition: polyp], [Condition: adenomyosis], [Condition: myoma], [Condition: malignancy] or [Condition: cervical pathology]).